Clinical trial exclusion criterion:
Heart disease or heart rhythm disorder or taking anti-arrhythmic drugs

Entity relations:
- OR("Heart disease", "heart rhythm disorder", "anti-arrhythmic drugs")